Clinical trial exclusion criterion:
History of decreased LVEF or symptomatic congestive heart failure (CHF) with previous adjuvant trastuzumab treatment.

Annotated entities:
- Condition: "congestive heart failure (CHF)"
- Qualifier: "symptomatic"
- Measurement: "LVEF"
- Value: "decreased"
- Drug: "trastuzumab"
- Qualifier: "adjuvant"
- Temporal: "previous"
- Temporal: "History"